與一般均衡飲食的孕婦相較，全素（strict vegetarians）的妊娠婦女，最可能缺乏下列何種維生素？
A. 維生素A
B. 維生素B12
C. 維生素C
D. 維生素K

正確答案：B. 維生素B12